心堵鎮是一個冠狀動脈疾病盛行的社區，林醫師努力推動社區居民的戒菸運動。林醫師調查社區中有那些團體如婦女、兒童健康組織等，能對戒菸者提供心理與社會支持。林醫師目前的工作，屬於 Lawrence W. Green 的 PRECEDE 模式中那一個步驟？
A. 社會診斷（social diagnosis）
B. 流行病學診斷（epidemiological diagnosis）
C. 行為診斷（behavioral diagnosis）
D. 教育診斷（educational diagnosis）

正確答案：D. 教育診斷（educational diagnosis）